Clinical trial exclusion criterion:
systemic disorders such as diabetes, rheumatoid arthritis, haematological diseases (coagulopathy), severe cardiovascular diseases, infections, immunodepression;

Annotated entities:
- Condition: "systemic disorders"
- Condition: "diabetes"
- Condition: "rheumatoid arthritis"
- Condition: "haematological diseases"
- Condition: "coagulopathy"
- Qualifier: "severe"
- Condition: "cardiovascular diseases"
- Condition: "infections"
- Condition: "immunodepression"